Lack of land autoimmune (no history of thyroid disease or diabetes type 1)

The above is a clinical trial inclusion criterion. Annotated with entity spans:
[Grammar_Error: Lack of land] [Condition: autoimmune] ([Negation: no] [Temporal: history] of [Condition: thyroid disease] or [Condition: diabetes type 1])